Clinical trial exclusion criterion:
6. History of evidence of clinically significant hepatic, cardiac, pulmonary, endocrine, immunological, gastrointestinal, hematological, vascular or collagen disease

Annotated entities:
- Parsing_Error: "6."
- Condition: "collagen disease"
- Condition: "vascular disease"
- Condition: "hematological disease"
- Condition: "gastrointestinal disease"
- Condition: "immunological disease"
- Condition: "endocrine disease"
- Condition: "pulmonary disease"
- Condition: "cardiac disease"
- Condition: "hepatic disease"
- Subjective_judgement: "clinically significant"
- Qualifier: "clinically significant"
- Temporal: "History"